Clinical trial exclusion criterion:
Diagnosis of peripartum- or chemotherapy-induced cardiomyopathy within the 12 months.

Entity relations:
- Has_qualifier("cardiomyopathy", "peripartum- induced")
- Has_temporal("cardiomyopathy", "within the 12 months")
- multi("chemotherapy-induced", "chemotherapy")
- multi("peripartum- induced", "peripartum")
- OR("peripartum- induced", "chemotherapy-induced")